Clinical trial exclusion criterion:
Conversion to open laparotomy from laparoscopic surgery

Entity relations:
- Has_context("open laparotomy", "Conversion")
- AND("Conversion", "laparoscopic surgery")